Children 6 month to 14 years who will be presented to the pediatric emergency or attended by emergency medical service who have active seizure and had no intravenous access would be eligible for the study.

The above is a clinical trial inclusion criterion. Annotated with entity spans:
[Person: Children] [Value: 6 month to 14 years] who will be presented to the [Visit: pediatric emergency] or [Observation: attended by emergency medical service] who have [Qualifier: active] [Condition: seizure] and had [Negation: no] [Device: intravenous access] would be eligible for the study.